Clinical trial exclusion criterion:
History of unstable progressive neurologic disorder of unknown cause

Annotated entities:
- Condition: "progressive neurologic disorder"
- Qualifier: "unknown cause"
- Qualifier: "unstable"
- Temporal: "History"